Clinical trial inclusion criteria:
Patients suspected to have vitamin B12 deficiency defined as a plasma vitamin B12 below the reference interval (<200 pmol/L).

Annotated entities:
- Condition: "vitamin B12 deficiency"
- Mood: "suspected"
- Measurement: "plasma vitamin B12"
- Value: "below the reference interval"
- Value: "<200 pmol/L"